Clinical trial exclusion criterion:
Pregnancy or childbearing potential without adequate contraception

Annotated entities:
- Condition: "Pregnancy"
- Observation: "childbearing potential"
- Negation: "without"
- Qualifier: "adequate"
- Procedure: "contraception"